Clinical trial exclusion criterion:
pregnant or lactating women

Entity relations:
- OR("pregnant", "lactating")